測量特定健康醫療照護施行於社區居民後之實際效果，稱為何種效果之評估？
A. efficacy 評估
B. efficiency 評估
C. effectiveness 評估
D. effect modification 評估

正確答案：C. effectiveness 評估